Clinical trial exclusion criterion:
Heart failure requiring loop diuretics

Annotated entities:
- Condition: "Heart failure"
- Drug: "loop diuretics"